11. History of severe allergic reactions to any unknown allergens or components of the study drugs.

The above is a clinical trial exclusion criterion. Annotated with entity spans:
[Parsing_Error: 11.] [Temporal: History] of [Qualifier: severe] [Condition: allergic reactions] [Drug: to any unknown allergens or components of the study drugs].